Clinical trial exclusion criterion:
5. Use of hormonal contraception (estrogen and progestin) within 3 months of study entry, or anticipated need to initiate estrogen-containing hormonal contraception during the study period

Entity relations:
- Subsumes("hormonal contraception", "estrogen")
- Has_index("within 3 months of study entry", "study entry")
- Has_qualifier("estrogen-containing hormonal contraception", "estrogen-containing")
- AND("estrogen-containing", "estrogen")
- Has_index("during the study period", "the study period")
- Has_context("estrogen-containing hormonal contraception", "anticipated need")
- Has_temporal("estrogen-containing hormonal contraception", "during the study period")
- Subsumes("hormonal contraception", "progestin")